Concurrently participating in another clinical study, at any time during the study period, in which the subject has been or will be exposed to an investigational or a non-investigational vaccine/product

The above is a clinical trial exclusion criterion. Annotated with entity spans:
[Temporal: Concurrently] [Observation: participating in] another clinical study, [Temporal: at any time during the study period], in which the subject has been or will be exposed to an [Qualifier: investigational] or a [Qualifier: non-investigational] [Drug: vaccine]/[Drug: product]